Admitted to any ICU and receiving invasive mechanical ventilation

The above is a clinical trial inclusion criterion. Annotated with entity spans:
Admitted to any [Visit: ICU] and receiving [Qualifier: invasive] [Procedure: mechanical ventilation]